How many genes constitute the DosR regulon, controlled by the dormancy survival regulator (DosR) in Mycobacterium tuberculosis?

The Mycobacterium dormancy survival regulator (DosR) regulon is composed of 48 co-regulated genes.